Clinical trial exclusion criteria:
Anaphylactic reaction to a previous dose of TIV(trivalent influenza vaccine)
Known IgE( Immunoglobulin E)-mediated hypersensitivity to eggs manifested as hives, swelling of the mouth and throat, difficulty in breathing, hypotension, or shock
Guillain-Barré syndrome within eight weeks of a previous influenza vaccine
Anaphylactic reaction to neomycin
Patients who have had influenza vaccine in two of the three previous years

Annotated entities:
- Condition: "Anaphylactic reaction"
- Drug: "trivalent influenza vaccine"
- Drug: "TIV"
- Condition: "IgE( Immunoglobulin E)-mediated hypersensitivity"
- Drug: "eggs"
- Condition: "hives"
- Condition: "swelling of the mouth and throat"
- Condition: "difficulty in breathing"
- Condition: "hypotension"
- Condition: "shock"
- Condition: "Guillain-Barré syndrome"
- Temporal: "within eight weeks of a previous influenza vaccine"
- Reference_point: "a previous influenza vaccine"
- Temporal: "previous"
- Drug: "influenza vaccine"
- Condition: "Anaphylactic reaction"
- Drug: "neomycin"
- Drug: "influenza vaccine"
- Temporal: "in two of the three previous years"